Clinical trial exclusion criterion:
A positive pre-study Hepatitis B surface antigen or positive Hepatitis C antibody result within 3 months of screening

Annotated entities:
- Measurement: "Hepatitis B surface antigen"
- Value: "positive"
- Temporal: "pre-study"
- Measurement: "Hepatitis C antibody"
- Value: "positive"
- Temporal: "within 3 months of screening"
- Reference_point: "screening"